Clinical trial exclusion criterion:
Cardiac and coronary diseases with pregnancy

Annotated entities:
- Condition: "coronary diseases"
- Condition: "Cardiac diseases"
- Condition: "pregnancy"